有關班氏絲蟲（Wuchereria bancrofti）的感染，下列敘述何者錯誤？
A. 病媒蚊吸血時直接將微絲蟲（microfilaria）注入人體
B. 蟲體在淋巴管發育為成蟲
C. 只有在夜間微絲蟲（microfilaria）才會大量出現在末梢血液
D. 在乳糜尿（chyluria）中也可能發現微絲蟲（microfilaria）

正確答案：A. 病媒蚊吸血時直接將微絲蟲（microfilaria）注入人體